5. If female and of childbearing potential, has a negative pregnancy test.

The above is a clinical trial inclusion criterion. Annotated with entity spans:
[Parsing_Error: 5.] If [Person: female] and of [Condition: childbearing potential], has a [Value: negative] [Measurement: pregnancy test].